有一位75歲男性病人，解尿時通常需要稍微用力才能解出來，且尿流較細，曾被泌尿科醫師診斷為前列腺肥大（benign prostatic hyperplasia or hypertrophy）。某日他因感冒與嘔吐服用藥物，結果突然發生無法排尿的情況，明明覺得膀胱很脹，但就是解不出來。請依前述情況回答下列3題。 下列藥物何者最不可能造成此種情況？
A. codeine（一種opiate，用於止咳）
B. diphenhydramine（一種抗組織胺[anti-histamine]）
C. metoclopramide（一種胃腸蠕動促進劑[prokinetic]）
D. pseudoephedrine（一種甲型腎上腺素受體促效劑[alpha-adrenergic agonist]）

正確答案：C. metoclopramide（一種胃腸蠕動促進劑[prokinetic]）